下列消化道中，那一部位黏膜為非角化複層扁平上皮（nonkeratinized stratified squamous epithelium）？
A. 十二指腸
B. 盲腸
C. 胃
D. 食道

正確答案：D. 食道